Clinical trial exclusion criterion:
Individuals with cochlear implants

Annotated entities:
- Device: "cochlear implants"